Clinical trial exclusion criterion:
patients with gastrointestinal conditions preventing adsorption of oral medication.

Annotated entities:
- Non-query-able: "patients with gastrointestinal conditions preventing adsorption of oral medication."